Congenital anomalies

The above is a clinical trial exclusion criterion. Annotated with entity spans:
[Condition: Congenital anomalies]